下列有關藥物與血漿蛋白結合之敘述，何者錯誤？
A. 大部分的藥物會與 albumin 結合
B. 鹼性藥物會與alpha1-acid glycoprotein結合
C. 血漿蛋白結合率高的藥物，藥效作用時間會縮短
D. 與血漿蛋白結合之藥物會暫時失去藥理活性

正確答案：C. 血漿蛋白結合率高的藥物，藥效作用時間會縮短